Clinical trial exclusion criteria:
Patients with active GIT bleeding.
Patients with history of bowel obstruction, perforation.
Patients with history of allergy to PEG.
Treatment with rifaximin or neomycin in the previous 7 days.
Patients with major psychiatric illness.
Patients receiving benzodiazepines and narcotics.
Patients with compromised renal.
Patients receiving medications highly bound to plasma proteins eg. Warfarin.
Pregnant or lactating women.
Fulminant hepatic failure.

Annotated entities:
- Qualifier: "active"
- Condition: "GIT bleeding"
- Condition: "bowel obstruction"
- Condition: "bowel perforation"
- Temporal: "history"
- Temporal: "history"
- Condition: "allergy"
- Drug: "PEG"
- Drug: "rifaximin"
- Drug: "neomycin"
- Temporal: "in the previous 7 days"
- Condition: "major psychiatric illness"
- Drug: "benzodiazepines"
- Drug: "narcotics"
- Condition: "compromised renal"
- Drug: "medications highly bound to plasma proteins"
- Drug: "Warfarin"
- Condition: "Pregnant"
- Condition: "lactating"
- Person: "women"
- Condition: "hepatic failure"
- Qualifier: "Fulminant"